Patients with non-cystic fibrosis bronchiectasis diagnosed by high-resolution CT;

The above is a clinical trial inclusion criterion. Annotated with entity spans:
Patients with [Condition: non-cystic fibrosis bronchiectasis] diagnosed by [Procedure: high-resolution CT];